Clinical trial exclusion criterion:
delirious state at presentation in the ED

Annotated entities:
- Condition: "delirious"